Which type of variants can be called by the VarDict algorithm?

VarDict simultaneously calls SNV, MNV, InDels, complex and structural variants, expanding the detected genetic driver landscape of tumors.